Clinical trial exclusion criterion:
Presence of other haemodynamically significant obstructive lesions of the LV outflow tract, including aortic and subaortic stenosis.

Annotated entities:
- Qualifier: "haemodynamically significant"
- Condition: "obstructive lesions"
- Qualifier: "LV outflow tract"
- Condition: "subaortic stenosis"
- Condition: "aortic stenosis"